Clinical trial inclusion criterion:
On the transplant waiting list followed by the University of Maryland's nephrology clinic or the Baltimore VA's nephrology clinic

Annotated entities:
- Non-query-able: "On the transplant waiting list followed by the University of Maryland's nephrology clinic or the Baltimore VA's nephrology clinic"